Clinical trial exclusion criterion:
Pregnant women who breast-feed or test positive for pregnancy

Entity relations:
- Has_value("test for pregnancy", "positive")
- OR("Pregnant", "test for pregnancy", "breast-feed")